下列何種藥品不會導致子宮鬆弛，故不能當做安胎藥？
A. Ritodrine
B. Indomethacin
C. Terbutaline
D. Misoprostol

正確答案：D. Misoprostol